Clinical trial inclusion criterion:
Failure of medical treatment for at least 3 months.

Entity relations:
- Has_context("medical treatment", "Failure")
- Has_multiplier("Failure", "for at least 3 months")